下列何者構成股三角（femoral triangle）的內側緣？
A. 內收長肌（adductor longus）
B. 恥骨肌（pectineus）
C. 縫匠肌（sartorius）
D. 股薄肌（gracilis）

正確答案：A. 內收長肌（adductor longus）